Clinical trial inclusion criteria:
Singleton pregnancy;
8-22 weeks gestation
Previous pregnancy complicated by gestational diabetes

Annotated entities:
- Condition: "Singleton pregnancy"
- Condition: "gestation"
- Multiplier: "8-22 weeks"
- Condition: "gestational diabetes"
- Condition: "pregnancy"